Clinical trial exclusion criterion:
Malignancy diagnosed or treated within 5 years (recent localized treatment of squamous or non-invasive basal cell skin cancers is permitted; cervical carcinoma in situ is allowed if appropriately treated prior to screening); subjects under evaluation for a malignancy are not eligible.

Entity relations:
- Has_temporal("Malignancy", "within 5 years")
- AND("treatment", "squamous cell skin cancer")
- Has_qualifier("treatment", "localized")
- Has_negation("treatment", "permitted")
- Has_qualifier("treated", "appropriately")
- Has_temporal("treated", "prior to screening")
- AND("cervical carcinoma in situ", "treated")
- Has_negation("cervical carcinoma in situ", "allowed")
- OR("squamous cell skin cancer", "non-invasive basal cell skin cancer")